Clinical trial exclusion criterion:
Patient with history of osteomyelitis/septic arthritis

Annotated entities:
- Condition: "septic arthritis"
- Condition: "osteomyelitis"
- Parsing_Error: "/"